Renal failure not due to LAL

The above is a clinical trial exclusion criterion. Annotated with entity spans:
[Condition: Renal failure] [Negation: not] [Mood: due to] [Condition: LAL]